Clinical trial exclusion criterion:
Patients that are considered ineligible for this study by the investigator.

Annotated entities:
- Non-query-able: "Patients that are considered ineligible for this study by the investigator."